Born, raised and currently living at low altitude (<800m).

The above is a clinical trial inclusion criterion. Annotated with entity spans:
Born, raised and currently [Observation: living at low altitude] ([Value: <800m]).